Clinical trial inclusion criterion:
Normal S-creatinine before surgery

Annotated entities:
- Value: "Normal"
- Measurement: "S-creatinine"
- Temporal: "before surgery"
- Reference_point: "surgery"
- Procedure: "surgery"